Absence of severe angina

The above is a clinical trial inclusion criterion. Annotated with entity spans:
[Negation: Absence of] [Qualifier: severe] [Condition: angina]